DSM-V diagnosis of a lifetime history of psychotic spectrum disorder

The above is a clinical trial exclusion criterion. Annotated with entity spans:
[Qualifier: DSM-V] diagnosis of a [Temporal: lifetime history] of [Condition: psychotic spectrum disorder]